有關脊髓損傷併四肢癱瘓神經功能恢復的敘述，下列何者錯誤？
A. 上肢功能之恢復多發生於受傷後6～9個月內
B. 上肢功能最快之恢復多發生於受傷後3個月內
C. 受傷初期之肌力與往後之恢復無關
D. 愈早恢復者，預後愈佳

正確答案：C. 受傷初期之肌力與往後之恢復無關